El debilitamiento de una respuesta por eliminación de los refuerzos o señales que la mantienen, se denomina:
1. Extinción.
2. Habituación.
3. Inhibición.
4. Desensibilización.

Respuesta correcta: 1. Extinción.